Clinical trial exclusion criterion:
Female of child-bearing potential who do not use adequate contraception and women who are pregnant or breast-feeding

Annotated entities:
- Pregnancy_considerations: "Female of child-bearing potential who do not use adequate contraception and women who are pregnant or breast-feeding"